安寧緩和醫療條例中，有關不施行心肺復甦術或維生醫療之規定，下列敘述何者錯誤？
A. 應由二位領有執業執照之醫師診斷確為末期病人
B. 應有意願人簽署之意願書
C. 有意願人為未成年人簽署意願書時，應得其法定代理人之同意
D. 有意願人為未成年人無法表達意願時，則應由法定代理人簽署意願書

正確答案：A. 應由二位領有執業執照之醫師診斷確為末期病人